20歲懷孕38週婦女，G1P0，因胎位不正接受剖腹產手術，手術中意外發現左側有一約10公分左右的卵巢腫 瘤，右側卵巢外觀正常，術中無腹水，於是行剖腹產後接	行卵巢囊腫摘除術（ovarian cystectomy），術中
 不慎發生囊腫破裂。術中冰凍切片病理報告為yolk sac tumor。接下來處置以何者為佳？
A. 作完月子後再視當時情況而定
B. 不宜餵奶並行骨盆腔放射線治療
C. 保留另一側卵巢及子宮以保留生育能力，並在術後行化學治療
D. 由於生殖細胞癌預後差，應即刻切除子宮及雙側卵巢輸卵管

正確答案：C. 保留另一側卵巢及子宮以保留生育能力，並在術後行化學治療